i. Warfarin, phenprocoumon: increase bleeding tendency ii. Increase blood concentration of phenytoin iii. sorivudine: inhibit DPD -> increase toxicity according to fluoropyrimidine iv. allopurinol : decrease activity of S-1

The above is a clinical trial exclusion criterion. Annotated with entity spans:
i. [Drug: Warfarin], [Drug: phenprocoumon]: [Non-representable: increase bleeding tendency] ii. [Non-representable: Increase blood concentration of phenytoin] iii. [Drug: sorivudine]: inhibit DPD -> increase toxicity according to [Drug: fluoropyrimidine] iv. [Drug: allopurinol] : decrease activity of S-1